Clinical trial exclusion criterion:
Transplant from donor positive for HIV, HBsAg, Hepatitis C.

Annotated entities:
- Condition: "positive for HIV"
- Condition: "positive for HBsAg"
- Condition: "positive for Hepatitis C"
- Procedure: "Transplant"
- Qualifier: "donor"